下列何者對足底長韌帶（long plantar ligament）及足底短韌帶（short plantar ligament）的敘述錯誤？
A. 足底長韌帶在淺層，足底短韌帶在深層
B. 足底長韌帶屬於距下關節（subtalar joint）的韌帶
C. 兩者後面皆附著於跟骨（calcaneus）
D. 兩者前面皆有附著至骰骨（cuboid）

正確答案：B. 足底長韌帶屬於距下關節（subtalar joint）的韌帶